下列何者不是人類微小病毒 B19（Human parvovirus B19）感染造成之臨床表現？
A. 傳染性紅斑（erythema infectiosum）
B. 嬰兒玫瑰疹（roseola infantum）
C. 過度性再生不良性貧血（transient aplastic anemia）
D. 水胎兒（hydrops fetalis）

正確答案：B. 嬰兒玫瑰疹（roseola infantum）